Clinical trial inclusion criterion:
Male or pre-menarchial female subjects.

Entity relations:
- OR("Male", "pre-menarchial")